Clinical trial exclusion criterion:
Unable to complete surveys in English

Annotated entities:
- Post-eligibility: "Unable to complete surveys in English"